Clinical trial inclusion criterion:
Registration with a GDP

Annotated entities:
- Non-query-able: "Registration with a GDP"